Clinical trial exclusion criterion:
recent surgery (< 3 months)

Annotated entities:
- Procedure: "surgery"
- Temporal: "recent"
- Temporal: "< 3 months"